Clinical trial inclusion criterion:
Age ≥ 18 years old

Annotated entities:
- Person: "Age"
- Value: "≥ 18 years old"